Clinical trial exclusion criterion:
Significant liver disease

Annotated entities:
- Qualifier: "Significant"
- Condition: "liver disease"